The presence of signed and dated informed consent to participate in a clinical study;

The above is a clinical trial inclusion criterion. Annotated with entity spans:
[Non-query-able: The presence of signed and dated informed consent to participate in a clinical study;]